Clinical trial exclusion criterion:
History of allergic or hypersensitivity to tandospirone

Entity relations:
- multi("tandospirone", "tandospirone")
- Has_qualifier("allergic", "tandospirone")
- OR("allergic", "hypersensitivity")